Cuando se realiza un cribado para una enfermedad, dirigido a grupos de riesgo elevado, buscando enfermedad en su estadio inicial, se denomina:
1. Cribado simple, no selectivo, precoz.
2. Cribado simple, selectivo, precoz.
3. Cribado múltiple, no selectivo, tardío.
4. Cribado múltiple, selectivo, precoz.
5. Cribado simple, selectivo, tardío.

Respuesta correcta: 2. Cribado simple, selectivo, precoz.